王先生 68 歲，過去有抽菸、B 型肝炎、高血壓及糖尿病史，但並無規則追蹤治療，主訴近一個月雙側下肢對稱水腫、腹脹且尿量有減少的現象。量得病人血壓為 148/92 mmHg，體溫 36°C，脈搏速 98/min 且不規則，呼吸速率 20/min，由以上初步病史，何者為最不可能的診斷？
A. 鬱血性心衰竭（congestive heart failure）
B. 腎衰竭（renal failure）
C. 肝硬化（liver cirrhosis）
D. 深層靜脈栓塞（deep vein thrombosis）

正確答案：D. 深層靜脈栓塞（deep vein thrombosis）